Uncontrolled medical problems including pulmonary, cardiovascular or orthopedic disease

The above is a clinical trial exclusion criterion. Annotated with entity spans:
[Qualifier: Uncontrolled] [Condition: medical problems] including [Condition: pulmonary], [Condition: cardiovascular] or [Condition: orthopedic disease]